Clinical trial inclusion criterion:
Both 'incident' (i.e. new) patients and 'flare' patients can be included.

Annotated entities:
- Non-query-able: "Both 'incident' (i.e. new) patients and 'flare' patients can be included"